Clinical trial exclusion criterion:
UTIs = 12 within 1 year

Annotated entities:
- Condition: "UTIs"
- Multiplier: "12 within 1 year"
- Temporal: "within 1 year"